Clinical trial exclusion criterion:
Significant renal disease manifested by serum creatinine > 2.5 mg/dL

Entity relations:
- Has_qualifier("renal disease", "Significant")
- Has_value("serum creatinine", "> 2.5 mg/dL")
- AND("renal disease", "serum creatinine")